Las secuencias de localización nuclear (NLS):
1. Se eliminan tras el trasporte nuclear de la proteína.
2. Están presentes en cualquier posición en las moléculas de RNA.
3. Se localizan en cualquier posición de la secuencia primaria de la proteína.
4. Son esenciales para la función de la clatrina.

Respuesta correcta: 3. Se localizan en cualquier posición de la secuencia primaria de la proteína.